Clinical trial exclusion criterion:
or they are receiving regular physical rehabilitation at present;

Entity relations:
- Has_temporal("regular physical rehabilitation", "at present")